Clinical trial exclusion criterion:
Clinically significant, symptomatic cardiovascular disease, New York Heart Association (NYHA) Grade II or greater congestive heart failure, serious cardiac arrhythmia, Grade II or greater peripheral vascular disease, or history of major heart surgery within 6 months of Day 1, or any situation that would likely limit compliance with study requirements

Annotated entities:
- Qualifier: "Clinically significant"
- Qualifier: "symptomatic"
- Condition: "cardiovascular disease"
- Measurement: "New York Heart Association (NYHA)"
- Value: "Grade II or greater"
- Condition: "congestive heart failure"
- Qualifier: "serious"
- Condition: "cardiac arrhythmia"
- Value: "Grade II or greater"
- Condition: "peripheral vascular disease"
- Temporal: "history of"
- Qualifier: "major"
- Procedure: "heart surgery"
- Temporal: "within 6 months of Day 1"
- Reference_point: "Day 1"
- Observation: "limit compliance"